pericardial effusion greater than 10 mm;

The above is a clinical trial exclusion criterion. Annotated with entity spans:
[Condition: pericardial effusion] [Qualifier: greater than 10 mm];